Recent significant blood donation or plasma donation

The above is a clinical trial exclusion criterion. Annotated with entity spans:
[Temporal: Recent] [Qualifier: significant] [Procedure: blood donation] or [Procedure: plasma donation]